Clinical trial inclusion criterion:
Ability and willingness to provide informed consent

Annotated entities:
- Informed_consent: "Ability and willingness to provide informed consent"